Visual analog score pain >= 5

The above is a clinical trial inclusion criterion. Annotated with entity spans:
[Measurement: Visual analog score pain] [Value: >= 5]